何種免疫抑制劑主要機轉在於結合 FK506-binding protein 以抑制磷酸水解酵素（calcineurin）活性，進而減低免疫相關細胞激素（cytokine）之生成？
A. Cyclosporine
B. Azathioprine
C. Tacrolimus
D. Methotrexate

正確答案：C. Tacrolimus